Permanent makeup or tattoos with metallic dyes

The above is a clinical trial exclusion criterion. Annotated with entity spans:
[Observation: Permanent makeup] or [Observation: tattoos] with [Device: metallic dyes]